Clinical trial inclusion criterion:
Availability to comply with the visits.

Annotated entities:
- Non-query-able: "Availability to comply with the visits"
- Post-eligibility: "Availability to comply with the visits"